Clinical trial exclusion criterion:
History of motion sickness or PONV

Entity relations:
- Has_temporal("motion sickness", "History")
- OR("motion sickness", "PONV")